胺甲醯麩胺酸（carbamoyl glutamate）常用於治療醋醯麩胺酸合成酶（N-acetylglutamate synthetase）缺乏所造成的尿素循環（urea cycle）障礙疾病，其藥理作用主要為何？
A. 提供尿素循環所需的中間產物，增進整個尿素循環的效率
B. 做為胺甲醯磷酸合成酶（carbamoyl phosphate synthetase I）的異位活化劑（allosteric activator），增進尿素循環的效率
C. 與甘胺酸（glycine）和麩胺醯胺（glutamine）結合成衍生物排出體外，減少尿素循環的負擔
D. 促進精胺酸（arginine）的合成，防止精胺酸缺乏

正確答案：B. 做為胺甲醯磷酸合成酶（carbamoyl phosphate synthetase I）的異位活化劑（allosteric activator），增進尿素循環的效率